Seizure occurred by metabolic factors (hypoglycemia, hypocalcemia, electrolyte disorder)

The above is a clinical trial exclusion criterion. Annotated with entity spans:
[Condition: Seizure] occurred by [Qualifier: metabolic factors] ([Condition: hypoglycemia], [Condition: hypocalcemia], [Condition: electrolyte disorder])